Clinical trial exclusion criterion:
serious bleeding during the course of the ulcer

Annotated entities:
- Qualifier: "serious"
- Condition: "bleeding"
- Temporal: "during the course of the ulcer"
- Reference_point: "the ulcer"
- Condition: "ulcer"